Planned continued antenatal care/ delivery at centre not included in trial

The above is a clinical trial exclusion criterion. Annotated with entity spans:
[Competing_trial: Planned continued antenatal care/ delivery at centre not included in trial]